Clinical trial exclusion criterion:
allergy to study drugs

Annotated entities:
- Condition: "allergy"
- Drug: "study drugs"